La medida de prevención secundaria recomendada para la prevención del cáncer de cuello uterino es:
1. Vacuna contra el VPH.
2. Promover el uso del preservativo.
3. Tratamiento sustitutito de estrógenos y progesterona en mujeres postmenopáusicas.
4. Realización de citología cervical a mujeres entre 25 y 65 años
5. Todas son recomendaciones de prevención secundaria.

Respuesta correcta: 4. Realización de citología cervical a mujeres entre 25 y 65 años